10. The target lesion(s) is (are) de novo or restenotic (including in-stent restenotic) native coronary artery lesion(s) with greater than 50 and less than 100% stenosis (visual estimate), or the target lesion is an acute (less than 1 month) total occlusion as evidenced by clinical symptoms.

The above is a clinical trial inclusion criterion. Annotated with entity spans:
10. The [Condition: target lesion](s) is (are) [Qualifier: de novo] or [Qualifier: restenotic] (including [Qualifier: in-stent restenotic]) native [Condition: coronary artery lesion](s) with [Value: greater than 50 and less than 100%] [Measurement: stenosis] (visual estimate), or the [Condition: target lesion] is an [Temporal: acute] ([Temporal: less than 1 month]) [Condition: total occlusion] as evidenced by [Observation: clinical symptoms].